Clinical trial exclusion criterion:
skin infection in proximity of injection site

Annotated entities:
- Condition: "skin infection"
- Qualifier: "injection site"